Untreated hyperthyroidism, or hypothyroidism.

The above is a clinical trial exclusion criterion. Annotated with entity spans:
[Qualifier: Untreated] [Condition: hyperthyroidism], or [Condition: hypothyroidism].